一位 60 歲女性因疲勞倦怠求診，她收集 24 小時尿液，尿中 creatinine 為60 mg/dL，總尿量為 1000 mL，血中 creatinine 為 2 mg/dL，請問她的 Ccr 是多少？
A. 6 mL/min
B. 10 mL/min
C. 21 mL/min
D. 25 mL/min

正確答案：C. 21 mL/min